Clinical trial inclusion criterion:
HAND diagnosis (ANI, MND, or HAD) within 60 days prior to study entry. HAND is defined as at least mild impairment on neurocognitive testing (more than one standard deviation below appropriate normative data in two domains of functioning) and no severely confounding factors.

Entity relations:
- Subsumes("HAND", "ANI")
- Has_temporal("HAND", "within 60 days prior to study entry")
- Has_multiplier("neurocognitive testing", "in two domains of functioning")
- Subsumes("impairment", "more than one standard deviation below appropriate normative data")
- Has_qualifier("impairment", "at least mild")
- Has_negation("severely confounding factors", "no")
- Subsumes("HAND", "neurocognitive testing")
- Subsumes("HAND", "impairment")
- Subsumes("HAND", "severely confounding factors")
- OR("ANI", "HAD", "MND")